Clinical trial exclusion criteria:
Ongoing allergen immunotherapy
upper respiratory tract infection
Pregnancy
Clinical history of lactose-intolerance or allergies to cow-milk

Annotated entities:
- Procedure: "allergen immunotherapy"
- Condition: "upper respiratory tract infection"
- Condition: "Pregnancy"
- Condition: "lactose-intolerance"
- Condition: "allergies to cow-milk"